Be healthy for their age group with or without medication on the basis of physical examination, medical history, vital signs, and 12-lead electrocardiogram (ECG) performed at Screening or admission. Minor deviations in ECG, which are not considered to be of clinical significance to the investigator, are acceptable

The above is a clinical trial inclusion criterion. Annotated with entity spans:
Be healthy for their age group with or without medication on the basis of [Procedure: physical examination], [Temporal: medical history], [Measurement: vital signs], and 12-lead electrocardiogram (ECG) [Temporal: performed at Screening or admission]. Minor [Condition: deviations in ECG], [Subjective_judgement: which are not considered to be of clinical significance to the investigator], [Grammar_Error: are acceptable]